Clinical trial exclusion criterion:
14. Statins: simvastatin, fluvastatin, rosuvastatin at doses greater than 10 mg/d, atorvastatin at doses greater than 10 mg/d.

Entity relations:
- Has_multiplier("atorvastatin", "doses greater than 10 mg/d")
- Has_multiplier("rosuvastatin", "doses greater than 10 mg/d")
- OR("simvastatin", "fluvastatin", "rosuvastatin", "atorvastatin")